58歲停經後出血的婦女，經子宮內膜切片診斷為子宮內膜癌，接受了全子宮切除、雙側卵巢輸卵管切除、骨盆腔及主動脈旁淋巴結摘除手術，病理報告發現癌細胞侵犯深層子宮肌肉層，淋巴結沒有癌細胞轉移，依據目前國際婦產科聯盟（international federation of gynecology and obstetrics, FIGO）這位患者的腫瘤分期應為：
A. Stage I
B. Stage IIa
C. Stage IIb
D. Stage III

正確答案：A. Stage I